¿Cuál de las siguientes características NO es típica de la personalidad obsesiva?
1. Generosidad.
2. Perfeccionismo.
3. Rigidez.
4. Escrupulosidad.

Respuesta correcta: 1. Generosidad.